Patients presenting for CMR with the clinical diagnosis of idiopathic dilated cardiomyopathy based upon left ventricular ejection fraction =40%, LV end-diastolic diameter =55 mm or left ventricular end-systolic diameter =45 mm, and the absence of coronary stenoses on angiography.

The above is a clinical trial inclusion criterion. Annotated with entity spans:
Patients presenting for CMR with the clinical diagnosis of [Condition: idiopathic dilated cardiomyopathy] based upon [Measurement: left ventricular ejection fraction] [Value: =40%], [Measurement: LV end-diastolic diameter] [Value: =55 mm] or [Measurement: left ventricular end-systolic diameter] [Value: =45 mm], and the [Negation: absence] of [Condition: coronary stenoses] on [Procedure: angiography].